Clinical trial exclusion criterion:
Brain tumor

Annotated entities:
- Condition: "Brain tumor"